Clinical trial exclusion criterion:
Walking capacity significantly limited by conditions other than claudication including leg (joint/musculoskeletal, neurologic) and systemic (heart, lung disease) pathology,

Entity relations:
- Has_value("Walking capacity", "significantly limited")
- Has_negation("claudication", "other than")
- Has_qualifier("leg pathology", "joint")
- Subsumes("systemic pathology", "heart disease")
- multi("conditions other than claudication", "other than claudication")
- multi("other than claudication", "claudication")
- AND("conditions other than claudication", "Walking capacity")
- AND("conditions other than claudication", "leg pathology")
- OR("leg pathology", "systemic pathology")
- OR("joint", "musculoskeletal", "neurologic")
- OR("heart disease", "lung disease")